Clinical trial exclusion criterion:
Known or suspected, acquired or bleeding or coagulation disorder in the subject or a first degree relative

Entity relations:
- Has_mood("acquired disorder", "Known")
- AND("acquired disorder", "in the subject")
- OR("Known", "suspected")
- OR("in the subject", "first degree relative")
- OR("acquired disorder", "coagulation disorder", "bleeding disorder")